Clinical trial exclusion criterion:
Major bleeding history or bleeding diathesis

Annotated entities:
- Qualifier: "Major"
- Temporal: "history"
- Condition: "bleeding"
- Condition: "bleeding diathesis"